Clinical trial inclusion criterion:
patients with severe left ventricle dysfunction with an ejection fraction (EF)=40%, being scheduled for revascularization.

Annotated entities:
- Qualifier: "severe"
- Condition: "left ventricle dysfunction"
- Measurement: "ejection fraction (EF)"
- Value: "=40%"
- Mood: "being scheduled for"
- Procedure: "revascularization"